下列何者是負責掌控手指肌肉執行精細動作的最主要運動路徑？
A. 側皮質脊髓路徑（lateral corticospinal tract）
B. 腹皮質脊髓路徑（ventral corticospinal tract）
C. 網狀脊髓路徑（reticulospinal tract）
D. 紅核脊髓路徑（rubrospinal tract）

正確答案：A. 側皮質脊髓路徑（lateral corticospinal tract）